Clinical trial exclusion criterion:
History of gastric surgery

Annotated entities:
- Procedure: "gastric surgery"